白斑病（vitiligo）是指皮膚上皮：
A. 部分或全部失去黑色素細胞
B. 仍有黑色素細胞，但缺乏黑色素
C. 被疤痕組織取代
D. 脫落

正確答案：A. 部分或全部失去黑色素細胞